Clinical trial inclusion criterion:
Patient body height greater or equal to 140 cm

Annotated entities:
- Measurement: "body height"
- Value: "greater or equal to 140 cm"